Clinical trial exclusion criterion:
Previous significant adverse reaction to naltrexone or diluent

Annotated entities:
- Temporal: "Previous"
- Qualifier: "significant"
- Condition: "adverse reaction"
- Drug: "naltrexone"
- Drug: "diluent"